Clinical trial inclusion criterion:
Serum albumin level = 3.5g/dl, ultrasound or CT scan confirmed ascites (=Grade 1)

Entity relations:
- Has_qualifier("ascites", "Grade 1")
- AND("ultrasound", "ascites")
- Has_value("Serum albumin", "= 3.5g/dl")
- OR("ultrasound", "CT scan")